Which MAP kinase phosphorylates the transcription factor c-jun?

c-Jun is phosphorylated by c-Jun NH2-terminal kinase (JNK).